Blunt or penetrating trauma

The above is a clinical trial inclusion criterion. Annotated with entity spans:
[Condition: Blunt] or [Condition: penetrating trauma]